Clinical trial exclusion criterion:
On systemic antibiotics or with an active bacterial infection at the time of surgery

Entity relations:
- multi("the time of surgery", "surgery")
- Has_index("at the time of surgery", "the time of surgery")
- Has_temporal("bacterial infection", "at the time of surgery")
- Has_qualifier("bacterial infection", "active")
- OR("systemic antibiotics", "bacterial infection")